Clinical trial inclusion criterion:
Creatinine clearance (CLcr) = 60 mL /min, as calculated by the Cockcroft-Gault equation

Annotated entities:
- Measurement: "Creatinine clearance (CLcr)"
- Value: "= 60 mL /min"
- Qualifier: "Cockcroft-Gault equation"